Clinical trial exclusion criterion:
7. Active, suspected or prior documented autoimmune disease (including inflammatory bowel disease, celiac disease, Wegner's granulomatosis, active Hashimoto's thyroiditis, rheumatoid arthritis, lupus, scleroderma and its variants, multiple sclerosis, myasthenia gravis). Vitiligo, type I diabetes mellitus, residual hypothyroidism due to autoimmune condition only requiring hormone replacement, psoriasis not requiring systemic treatment, or conditions not expected to recur in the absence of an external trigger are permitted.

Entity relations:
- Subsumes("autoimmune disease", "inflammatory bowel disease")
- AND("due to autoimmune condition", "autoimmune condition")
- Has_qualifier("residual hypothyroidism", "due to autoimmune condition")
- AND("requiring hormone replacement", "hormone replacement")
- Has_qualifier("autoimmune condition", "requiring hormone replacement")
- Has_negation("requiring systemic treatment", "not")
- AND("requiring systemic treatment", "systemic treatment")
- Has_qualifier("psoriasis", "requiring systemic treatment")
- Has_qualifier("conditions", "not expected to recur")
- OR("inflammatory bowel disease", "multiple sclerosis", "scleroderma variants", "scleroderma", "lupus", "rheumatoid arthritis", "Hashimoto's thyroiditis", "Wegner's granulomatosis", "celiac disease", "myasthenia gravis")
- OR("Vitiligo", "residual hypothyroidism", "type I diabetes mellitus")
- OR("autoimmune condition", "conditions", "psoriasis")